Clinical trial exclusion criterion:
Signs and/or symptoms of ocular inflammation/infection (bacterial, viral, fungal, caused by Chlamydia, by Mycobacterium, Acanthamoeba or of allergic etiology).

Entity relations:
- Subsumes("ocular inflammation", "bacterial etiology")
- OR("bacterial etiology", "viral etiology", "fungal etiology", "caused by Chlamydia", "caused by Mycobacterium", "caused by Acanthamoeba", "allergic etiology")
- OR("ocular inflammation", "ocular infection")